require prednisone, methotrexate, or other immunosuppressing medications

The above is a clinical trial exclusion criterion. Annotated with entity spans:
require [Drug: prednisone], [Drug: methotrexate], or [Qualifier: other] [Drug: immunosuppressing medications]